Clinical trial exclusion criterion:
Sleep apnoea

Annotated entities:
- Condition: "Sleep apnoea"